不孕症婦女接受試管嬰兒治療，打human chorionic gonadotropin（hCG）誘導排卵後，多久進行取卵最適當？
A. 12至14小時
B. 24至26小時
C. 34至36小時
D. 50至56小時

正確答案：C. 34至36小時